有關細菌抗藥性之敘述，下列何者錯誤？
A. 廣泛抗藥性結核桿菌（XDR-TB）比多重抗藥性結核桿菌（MDR-TB）抗更多種藥物
B. 厭氧菌通常對胺基糖苷類（aminoglycosides）藥物具感受性
C. 具新德里金屬β-內酰胺酶（NDM）之細菌，對大多β-內酰胺（β-lactams）有抗藥性
D. 細菌青黴素結合蛋白質（penicillin-binding protein）之改變會導致對青黴素（penicillin）產生抗性

正確答案：B. 厭氧菌通常對胺基糖苷類（aminoglycosides）藥物具感受性